Virgina Henderson describe la relación de la enfermera con el enfermo en la estructura siguiente:
1. Niveles: Sustitución. Ayuda. Acompañamiento.
2. Roles: Extraño. Persona recurso. Docente. Liderazgo. Sustituto. Asesoramiento.
3. Habilidades: Principiante. Principiante avanzado. Eficaz. Experto.
4. Modos de ayuda: Actuar por otro. Guiar a otro. Apoyar a otro. Proporcionar un entorno que fomente el desarrollo. Enseñar a otro.
5. Estilos: Estimulación. Confirmación. Conservación y continuidad de la vida. Autoimagen. Compensación y sosiego.

Respuesta correcta: 1. Niveles: Sustitución. Ayuda. Acompañamiento.